Which is the function of the PRDM9 protein in mammals?

in mammals , recombination preferentially occurs in genomic regions known as hotspots. the protein that activates these hotspots is prdm9